Both males and females.

The above is a clinical trial inclusion criterion. Annotated with entity spans:
Both [Person: males] and [Person: females].